Clinical trial exclusion criterion:
congestive heart failure NYHA III-IV

Annotated entities:
- Condition: "congestive heart failure"
- Measurement: "NYHA"
- Value: "III-IV"